Clinical trial inclusion criterion:
3. History of menstrual events that occur in regular cycles

Annotated entities:
- Parsing_Error: "3."
- Condition: "menstrual events that occur in regular cycles"
- Temporal: "History"